下列何者不是嬰兒期水腦（Infantile Hydrocephalus）的致病原因之一？
A. 先天性大腦導水管狹窄
B. 先天性無腦症
C. 嬰兒期腦內出血
D. 嬰兒期腦部感染

正確答案：B. 先天性無腦症